Clinical trial inclusion criterion:
planned to DAPT for 1 year after PCI

Entity relations:
- Has_index("after PCI", "PCI")
- multi("PCI", "PCI")
- Has_multiplier("DAPT", "for 1 year")
- Has_temporal("DAPT", "after PCI")
- Has_mood("DAPT", "planned to")